Clinical trial inclusion criterion:
Age 65 - 79

Entity relations:
- Has_value("Age", "65 - 79")